Any history of anorexia or bulimia within 2 years before Screening, Attention Deficit Hyperactivity Disorder, any Diagnostic and Statistical Manual of Mental Disorders, 5th Edition depressive disorder, bipolar disorder, or schizophrenia

The above is a clinical trial exclusion criterion. Annotated with entity spans:
Any [Temporal: history] of [Condition: anorexia] or [Condition: bulimia] [Temporal: within 2 years before Screening], [Condition: Attention Deficit Hyperactivity Disorder], any [Qualifier: Diagnostic and Statistical Manual of Mental Disorders, 5th Edition] [Condition: depressive disorder], [Condition: bipolar disorder], or [Condition: schizophrenia]